下列對於家暴與兒虐受害者之敘述，何者錯誤？
A. 經常是重複求診者
B. 法律規定兒虐事件一定要通報
C. 所敘述之受傷機轉與傷勢常不一致
D. 加害者少有藥物成癮行為

正確答案：D. 加害者少有藥物成癮行為